Clinical trial inclusion criterion:
Calculated eGFR below 60ml/min/1.73m2 (MDRD)

Annotated entities:
- Measurement: "Calculated eGFR"
- Value: "below 60ml/min/1.73m2"